Clinical trial exclusion criterion:
Ongoing bleeding

Entity relations:
- Has_temporal("bleeding", "Ongoing")